Clinical trial inclusion criterion:
Subject is scheduled for a procedure that requires general or neuraxial anesthesia

Entity relations:
- multi("scheduled for a procedure", "procedure")
- AND("procedure", "general t")
- OR("general t", "neuraxial anesthesia")